Clinical trial exclusion criterion:
antiseizure medications including valproic acid, zonisamide, topiramate, and lamotrigine

Entity relations:
- Subsumes("antiseizure medications", "valproic acid")
- OR("valproic acid", "lamotrigine", "zonisamide", "topiramate")